關於基礎體溫（basal body temperature），下列敘述何者正確？
A. 單相（monophasic）體溫確定為排卵
B. 懷孕時，雌激素使體溫維持高溫
C. 服用 synthetic progestational agent 後，基礎體溫會升高
D. 根據基礎體溫表，最高受孕機率是在高溫期後 2 天

正確答案：C. 服用 synthetic progestational agent 後，基礎體溫會升高